What is aphasia?

Aphasia  is an inability to comprehend or formulate language because of damage to specific brain regions.